MHC class II 分子的缺乏，會產生下列何種現象？
A. 因 TAP1 及 TAP2 基因之缺陷，MHC class II 分子無法表現於細胞表面
B. CD8 αβ T 細胞的成熟受到阻礙，所以數目稀少
C. CD4 T 細胞及抗原呈現細胞功能低下
D. 患者主要表現為皮膚潰瘍、血管炎及慢性呼吸道感染

正確答案：C. CD4 T 細胞及抗原呈現細胞功能低下